Clinical trial inclusion criterion:
The expected survival> 3 months;

Annotated entities:
- Observation: "expected survival"
- Value: "> 3 months"